¿A qué género bacteriano pertenece la especie causante de la difteria?
1. Micoplasma.
2. Corynebacterium.
3. Brucella.
4. Acinetobacter.

Respuesta correcta: 2. Corynebacterium.